Clinical trial inclusion criterion:
Patients with Glasgow Coma Scale (GCS) 15/15

Entity relations:
- Subsumes("Glasgow Coma Scale", "GCS")
- Has_value("Glasgow Coma Scale", "15/15")